What protein complex is altered in "Coffin-Siris syndrome"?

he genes causative of CSS mainly encode the SWI/SNF complex, which contributes to chromatin remodeling and regulates the access of transcriptional factors to specific gene sites.